Clinical trial inclusion criteria:
Acquired acute ankle injury (injured less than 48 hours ago);
Clinical diagnosis of a Grade I or II ankle sprain
Is eligible to receive comprehensive medical care from Garrison Petawawa

Annotated entities:
- Condition: "acute ankle injury"
- Qualifier: "Acquired"
- Temporal: "less than 48 hours ago"
- Qualifier: "Grade I"
- Qualifier: "Grade II"
- Condition: "ankle sprain"
- Non-query-able: "Is eligible to receive comprehensive medical care from Garrison Petawawa"